Clinical trial exclusion criterion:
renal disease, as glomerular filtration rate (GFR) <60 ml/min/1,73 m*m

Entity relations:
- Subsumes("glomerular filtration rate", "GFR")
- Has_value("glomerular filtration rate", "<60 ml/min/1,73 m*m")